Clinical trial exclusion criterion:
Currently prescribed medication with anti-epileptic activity (keppra, dilantin, tegretol, lamictal, topamax, etc.)

Annotated entities:
- Drug: "medication"
- Qualifier: "anti-epileptic activity"
- Drug: "keppra"
- Drug: "dilantin"
- Drug: "tegretol"
- Drug: "lamictal"
- Drug: "topamax"